急診室的護理長接到骨科值班醫師的電話通知，說因為骨科沒有住院病床了，今天晚上只要是骨折病人都不要讓他們掛號，直接叫他們自己到別的醫院去求診，護理長不確定這樣做是否正確，就反問如果是危急的病人呢？該醫師回答說那更是要叫他趕快走，這樣的說法對嗎？
A. 對，根據醫療法的規定，沒有掛號就不算是病人
B. 對，因為掛號之後也沒辦法處置，可以幫病人省錢
C. 不對，根據醫療法第 73 條之規定，危急病人先予適當之急救，始可轉診
D. 不對，根據醫療法第 73 條之規定，危急病人不能轉診

正確答案：C. 不對，根據醫療法第 73 條之規定，危急病人先予適當之急救，始可轉診